Clinical trial exclusion criterion:
severe gastroparesis requiring endoscopic placement of capsule

Annotated entities:
- Condition: "gastroparesis"
- Qualifier: "severe"
- Procedure: "endoscopic placement"
- Device: "capsule"
- Mood: "requiring"